La mayoría de las proteínas mitocondriales son sintetizas por ribosomas situados en:
1. Citosol.
2. Retículo endoplásmico.
3. Matriz mitocondrial.
4. Envoltura nuclear.

Respuesta correcta: 1. Citosol.